Falciform ligament sign is characteristic to which disease?

The falciform ligament sign (gas outlining the falciform ligament) is characteristic to pneumoperitoneum due to intestinal perforation.